Previous history of receiving rabies immune globulin.

The above is a clinical trial exclusion criterion. Annotated with entity spans:
[Temporal: Previous history] of receiving [Drug: rabies immune globulin].